下列何者為連接卵巢與子宮的構造？
A. 懸韌帶
B. 卵巢繫膜
C. 卵巢韌帶
D. 子宮圓韌帶

正確答案：C. 卵巢韌帶